COPD發炎反應中有許多發炎介質，包括IL-8, TNF-α, IL-1β這些發炎介質的基因活化主要是經由那一個轉錄因子 （Transcriptional factor）？
A. NF-κB
B. AP-1
C. JNK
D. HIF-1α

正確答案：A. NF-κB